Clinical trial exclusion criterion:
Body Mass Index (BMI) > 50

Entity relations:
- Has_value("Body Mass Index (BMI)", "> 50")